Clinical trial inclusion criterion:
Experience with pump-assisted infusions of IgPro20 at tolerated volumes of 25 mL/injection site for at least 1 month prior to Day 1.

Annotated entities:
- Qualifier: "pump-assisted infusions"
- Drug: "IgPro20"
- Multiplier: "volumes of 25 mL/injection site"
- Qualifier: "tolerated"
- Temporal: "for at least 1 month prior to Day 1"
- Reference_point: "Day 1"